Clinical trial exclusion criterion:
Psychiatric diseases; Severe endocrinopathies;

Annotated entities:
- Condition: "Psychiatric diseases"
- Qualifier: "Severe"
- Condition: "endocrinopathies"